mitral stenosis;

The above is a clinical trial exclusion criterion. Annotated with entity spans:
[Condition: mitral stenosis];